有關嗜睡症（Narcolepsy）的主要臨床病徵，下列何者錯誤？
A. 猝倒症（cataplexy）
B. 夢遊（sleep walking）
C. 睡眠麻痺（sleep paralysis）
D. 白天嗜睡（excessive daytime sleep）

正確答案：B. 夢遊（sleep walking）